Blood pressured controlled at 150/100 mHg following drug administration;

The above is a clinical trial inclusion criterion. Annotated with entity spans:
[Measurement: Blood pressured] [Qualifier: controlled] at [Value: 150/100 mHg] following drug administration;